Clinical trial exclusion criterion:
respiratory disease, acute infection or chronic disease activity period

Entity relations:
- OR("respiratory disease", "chronic disease activity period", "acute infection")